Clinical trial inclusion criterion:
Primary tumor must have been diagnosed histologically as either epithelial ovarian cancer, fallopian tube cancer, or primary peritoneal cancer (not borderline or low malignant potential epithelial carcinoma).

Annotated entities:
- Condition: "epithelial ovarian cancer"
- Procedure: "histologically"
- Qualifier: "Primary tumor"
- Condition: "fallopian tube cancer"
- Condition: "primary peritoneal cancer"
- Qualifier: "borderline"
- Condition: "epithelial carcinoma"
- Negation: "not"
- Qualifier: "low malignant potential"